anticoagulants usage

The above is a clinical trial exclusion criterion. Annotated with entity spans:
[Drug: anticoagulants] usage